Clinical trial exclusion criterion:
Currently taking 1 g or more of ascorbic acid supplementation daily

Entity relations:
- Has_multiplier("ascorbic acid", "1 g or more")